下列何者不屬於大腦白質的聯合纖維（association fiber）？
A. 弓狀束（arcuate fasciculus）
B. 扣帶（cingulum）
C. 胼胝體（corpus callosum）
D. 鈎束（uncinate fasciculus）

正確答案：C. 胼胝體（corpus callosum）